Clinical trial inclusion criterion:
1. Women 18 to 40 years of age inclusive who can give written informed consent

Entity relations:
- Has_value("age", "18 to 40 years")